置放中央靜脈導管（central venous cannulation）時，最不可能發生下列那些併發症？
A. 選用right internal jugular vein時，發生 pneumothorax
B. 選用left internal jugular vein時，發生chylothorax
C. 選用left subclavian vein時，發生pneumothorax
D. 選用antecubital vein時，發生brachial plexus損傷

正確答案：D. 選用antecubital vein時，發生brachial plexus損傷